下列何者是膽囊所沒有的構造？
A. 黏膜肌層（muscularis mucosa）
B. 固有層（lamina propria）
C. 外肌層（muscularis externa）
D. 外膜（adventitia）

正確答案：A. 黏膜肌層（muscularis mucosa）